Clinical trial exclusion criterion:
anaphylaxis in the past six weeks,

Annotated entities:
- Condition: "anaphylaxis"
- Temporal: "in the past six weeks"